Clinical trial exclusion criterion:
Allergy to used drugs (PEG, neomycin, metronidazole)

Entity relations:
- Subsumes("drugs", "PEG")
- AND("Allergy", "drugs")
- OR("PEG", "metronidazole", "neomycin")